Los inhibidores de la hidroximetil-glutaril-CoA reductasa (HMG-CoA reductasa), como las estatinas:
1. Aumentan la síntesis intracelular de colesterol.
2. Causan un descenso del número de receptores de LDL presentes en la superficie de los hepatocitos.
3. Disminuyen la síntesis intracelular de triacilglicéridos.
4. Disminuyen la síntesis intracelular de colesterol e inducen la expresión de los receptores LDL.
5. Aumentan la síntesis de hormonas esteroideas.

Respuesta correcta: 4. Disminuyen la síntesis intracelular de colesterol e inducen la expresión de los receptores LDL.